Clinical trial exclusion criterion:
History of adverse effects from medications to be used in this study

Annotated entities:
- Non-representable: "History of adverse effects from medications to be used in this study"